若打算研究維他命 D 之攝取與癌症發生間的關係，找一群人依其近一星期的飲食習慣計算維他命 D 每日平均攝取量，對最高的四分之一和最低的四分之一追蹤數年後比較癌症之發生率，則本研究為下列何種流行病學研究的設計？
A. 世代研究（cohort study）
B. 個案對照研究（case-control study）
C. 臨床試驗研究（clinical trial）
D. 橫斷式研究（cross-sectional study）

正確答案：A. 世代研究（cohort study）